Clinical trial exclusion criterion:
preexisting pectoral, axillar, thoracic homolateral pain

Annotated entities:
- Condition: "thoracic pain"
- Qualifier: "homolateral"
- Condition: "axillar pain"
- Condition: "pectoral pain"